陳女士，35 歲，過去除自然生產 2 次外，無特殊疾病史，因性行為後陰道出血至門診就診，經內診發現子宮頸有 1 公分潰瘍易出血傷口，切片證實為子宮頸鱗狀上皮癌，內診並無發現陰道壁、子宮旁結締組織及骨盆腔壁的侵犯，胸部 X 光正常，腎盂攝影並無顯示腎盂或輸尿管水腫，電腦斷層檢查未見淋巴結腫大，關於陳女士接下來的治療，何者最適當？
A. 單純性全子宮切除（simple hysterectomy）
B. 單純性全子宮切除及骨盆腔淋巴結摘除手術
C. 根除性子宮全切除（radical hysterectomy）及骨盆腔淋巴結摘除手術
D. 放射線合併化學治療

正確答案：C. 根除性子宮全切除（radical hysterectomy）及骨盆腔淋巴結摘除手術